Which drug is the first oral ghrelin receptor inverse agonist to be profiled in healthy subjects?

PF-05190457 is the first oral ghrelin receptor inverse agonist to be profiled in healthy subjects.